Clinical trial exclusion criterion:
Patients allergic to any medication given in either arm (list medications)

Entity relations:
- AND("allergic", "medication")